History of use of over 30mg oxycodone or equivalent per day

The above is a clinical trial exclusion criterion. Annotated with entity spans:
History of use of [Multiplier: over 30mg] [Drug: oxycodone] or equivalent per day